一位68歲女性病患罹患肺癌末期，已經簽署DNR意願書。最近幾個月陸續有幾次呼吸道感染病史，經過抗生 素治療後，都恢復得不錯。最近幾天病患開始出現發燒及頻尿的現象，急診診斷為泌尿道發炎，合併 血症。於急診治療過程中，病患血壓開始不穩，尿量減少，有 血性休克現象，隨後呼吸變得淺快，血氧下
 降。臨床上有氣管內管插管之必要性，但病患已經簽署DNR意願書，這時醫師是否應該為其插管，或進行抗生素及大量點滴輸液來進行治療？下列敘述何者最為正確？
A. 病患本次住院，係因為	血性休克，屬於可治療之疾病，該疾病的病程進展也未必會死亡，因此不適用
B. 病患已經簽署了DNR，就應該尊重其意願，不論這次住院的疾病是否可治癒，也不論該病程是否一定會進展到死亡，都一律適用DNR相關規定，而不能為其插管，但可以考慮進行抗生素及大量點滴輸液來進行治療
C. 病患已經簽署了DNR，就應該尊重其意願，醫師不僅不能為其插管，也不應該進行抗生素及大量點滴輸液
D. DNR簽署後，具有終身的效力，除非病患自己撤銷，否則相關急救的醫療行為，包括抗生素以及點滴治療

正確答案：A. 病患本次住院，係因為	血性休克，屬於可治療之疾病，該疾病的病程進展也未必會死亡，因此不適用